Clinical trial exclusion criterion:
Surgery to the treated limb less than 6 months previously.

Entity relations:
- Has_qualifier("Surgery", "treated limb")
- Has_temporal("Surgery", "less than 6 months")